¿Cuál de las siguientes condiciones provoca un descenso de la saturación de O2 de la hemoglobina que no es debido a una disminución de la presión parcial de oxígeno?
1. Cociente ventilación-perfusión menor de lo normal.
2. Anemia.
3. Intoxicación por monóxido de carbono.
4. Hipoventilación.
5. Shunt venoarterial.

Respuesta correcta: 3. Intoxicación por monóxido de carbono.